Clinical trial exclusion criterion:
Known acute pancreatitis or known severe hepatic dysfunction, including hepatic failure, cirrhosis, portal hypertension (oesophageal varices) and active hepatitis

Annotated entities:
- Condition: "acute pancreatitis"
- Condition: "hepatic dysfunction"
- Qualifier: "severe"
- Condition: "hepatic failure"
- Condition: "cirrhosis"
- Condition: "portal hypertension"
- Condition: "active hepatitis"
- Condition: "oesophageal varices"